Clinical trial exclusion criterion:
Endoscopically confirmed active upper gastrointestinal hemorrhage on Day 1.

Entity relations:
- multi("Endoscopically confirmed", "Endoscopically")
- Has_temporal("upper gastrointestinal hemorrhage", "active")
- multi("on Day 1", "Day 1")
- Has_qualifier("upper gastrointestinal hemorrhage", "Endoscopically confirmed")
- Has_temporal("upper gastrointestinal hemorrhage", "on Day 1")